Clinical trial inclusion criterion:
Global Initiative for Chronic Obstructive Lung Disease (GOLD) 0: FEV1=0.80 and FEV1/FVC>0.70 Forced Expiratory Volume in 1 second (FEV1), Forced Vital Capacity (FVC)

Entity relations:
- Has_value("FEV1/FVC", ">0.70")
- Has_value("FEV1", "=0.80")
- Has_value("Global Initiative for Chronic Obstructive Lung Disease (GOLD)", "0")
- Subsumes("Global Initiative for Chronic Obstructive Lung Disease (GOLD)", "FEV1")